關於 Absence seizure 的描述，何者為對？
A. 採用 ethosuximide 或 valproic acid 為基本的治療藥物
B. 僅發生在青少年時期而不發生在成年
C. EEG 有 focal spike
D. 抽搐後會有一段時間意識不清

正確答案：A. 採用 ethosuximide 或 valproic acid 為基本的治療藥物